Clinical trial exclusion criterion:
renal impairment - CrCl =60 mL/minute

Annotated entities:
- Condition: "renal impairment"
- Measurement: "CrCl"
- Value: "=60 mL/minute"